Clinical trial exclusion criterion:
Participant has a history of spontaneous, prolonged or severe bleeding of unclear origin

Annotated entities:
- Condition: "bleeding"
- Qualifier: "unclear origin"
- Qualifier: "severe"
- Qualifier: "prolonged"
- Qualifier: "spontaneous"
- Temporal: "history"
- Undefined_semantics: "bleeding"